Clinical trial exclusion criterion:
Congenital or rheumatic heart diseases

Annotated entities:
- Qualifier: "Congenital"
- Qualifier: "rheumatic"
- Condition: "heart diseases"